有關高分子量之unfractionated heparin（UFH）與低分子量LMW heparin之敘述，下列何者錯誤？
A. 兩者皆可預防和治療肺栓塞
B. UFH可有效中和factor Xa和thrombin，但LMW heparin對thrombin有較高之中和能力
C. LMW heparin較少引發thrombocytopenia現象
D. 臨床上LMW heparin之劑量較好控制

正確答案：B. UFH可有效中和factor Xa和thrombin，但LMW heparin對thrombin有較高之中和能力